Clinical trial inclusion criterion:
female subjects of childbearing potential must have a negative pregnancy test.

Entity relations:
- Has_value("pregnancy test", "negative")
- AND("childbearing potential", "pregnancy test")
- AND("female", "pregnancy test")